¿Cuáles de los siguientes patógenos es avirulento si no presenta cápsula?
1. Staphylococcus aureus.
2. Campylobacter coli.
3. Bordetella pertussis.
4. Strepptococcus pneumoniae.

Respuesta correcta: 4. Strepptococcus pneumoniae.